Clinical trial exclusion criterion:
age <18 years

Annotated entities:
- Person: "age"
- Value: "<18 years"